調整飲食為治療胃腸疾病重要的手段，下列有關胃腸疾病與飲食方式調整的敘述，何者錯誤？
A. gastroparesis患者最好用liquid meals
B. dumping syndrome患者須限制脂肪量
C. irritable bowel syndrome患者可考慮高纖飲食
D. short bowel syndrome患者可進食medium-chain triglyceride

正確答案：B. dumping syndrome患者須限制脂肪量